Clinical trial exclusion criterion:
previous use of insulin pump

Annotated entities:
- Device: "insulin pump"